Ocular surface scarring diseases

The above is a clinical trial exclusion criterion. Annotated with entity spans:
[Condition: Ocular surface scarring diseases]